¿Qué medida de intervalo será la más adecuada para evaluar una conducta breve y de alta frecuencia (p. ej., tic o decir tacos) en un niño/a?:
1. Intervalo momentáneo.
2. Intervalo proporcional.
3. Intervalo completo.
4. Intervalo secuencial.
5. Intervalo parcial.

Respuesta correcta: 5. Intervalo parcial.